Clinical trial inclusion criteria:
Age >= 65 years, < 90 years;
Scheduled to undergo surgery for primary solid organ cancer under general anesthesia, with an expected duration of surgery >=2 hours;
Planned to use patient-controlled intravenous analgesia after surgery;
Provide written informed consent.

Annotated entities:
- Person: "Age"
- Value: ">= 65 years, < 90 years"
- Mood: "Scheduled"
- Procedure: "surgery"
- Qualifier: "primary"
- Condition: "solid organ cancer"
- Procedure: "general anesthesia"
- Non-representable: "with an expected duration of surgery >=2 hours;"
- Qualifier: "patient-controlled"
- Procedure: "intravenous analgesia"
- Temporal: "after surgery"
- Procedure: "surgery"
- Reference_point: "surgery"
- Post-eligibility: "Provide written informed consent"